Clinical trial inclusion criteria:
Cervical spine injury with functional loss in the upper extremity
Greater than 4 months out from C-spine injury
Stable motor recovery
Medically stable
International Classification for Surgery of the Hand in Tetraplegia of 0-5 at 6 months
Grade 0 finger/thumb extension at 6 months
Subjects fluent in English or when not fluent, an appropriate translator is present

Annotated entities:
- Condition: "Cervical spine injury"
- Observation: "functional loss"
- Qualifier: "upper extremity"
- Condition: "C-spine injury"
- Temporal: "Greater than 4 month"
- Observation: "motor recovery"
- Qualifier: "Stable"
- Condition: "stable"
- Qualifier: "Medically"
- Measurement: "International Classification for Surgery of the Hand in Tetraplegia"
- Value: "0-5"
- Temporal: "at 6 months"
- Measurement: "extension"
- Qualifier: "thumb"
- Qualifier: "finger"
- Value: "Grade 0"
- Temporal: "at 6 months"
- Post-eligibility: "Subjects fluent in English or when not fluent, an appropriate translator is present"